Clinical trial exclusion criterion:
Previously treated with mirabegron within 60 days prior to the baseline visit (Visit 2), or previously having failed treatment with mirabegron regardless of duration and timing of treatment.

Annotated entities:
- Drug: "mirabegron"
- Temporal: "within 60 days prior to the baseline visit"
- Reference_point: "baseline visit"